Clinical trial exclusion criteria:
Participants with congenital or acquired hypogonadism for whom long-term therapy with placebo would not be medically appropriate
Participants with prostate specific antigen (PSA) > 3.0 ng/mL (or 1.5 if on 5-alpha reductase inhibitors)
Participants who have been treated with testosterone in the past 6 months and for whom testosterone therapy is contraindicated
Confirmed testosterone < 100 ng/dL
Body Mass Index (BMI) > 50
Hemoglobin A1c (HbA1C) > 11%
Hematocrit (Hct) > 50%
Estimated Glomerular Filtration Rate (eGFR) < 30 ml/min
History of deep vein thrombosis or pulmonary embolism or prostate cancer or heart failure (Class III and IV).

Annotated entities:
- Condition: "acquired hypogonadism"
- Condition: "congenital hypogonadism"
- Non-representable: "for whom long-term therapy with placebo would not be medically appropriate"
- Measurement: "prostate specific antigen (PSA)"
- Value: "> 3.0 ng/mL"
- Drug: "5-alpha reductase inhibitors"
- Value: "1.5"
- Drug: "testosterone"
- Temporal: "in the past 6 months"
- Condition: "contraindicated"
- Procedure: "testosterone therapy"
- Drug: "testosterone"
- Measurement: "Confirmed testosterone"
- Value: "< 100 ng/dL"
- Measurement: "Body Mass Index (BMI)"
- Value: "> 50"
- Measurement: "Hemoglobin A1c (HbA1C)"
- Value: "> 11%"
- Measurement: "Hematocrit (Hct)"
- Value: "> 50%"
- Measurement: "Estimated Glomerular Filtration Rate (eGFR)"
- Value: "< 30 ml/min"
- Condition: "deep vein thrombosis"
- Condition: "pulmonary embolism"
- Condition: "prostate cancer"
- Condition: "heart failure"
- Qualifier: "Class III"
- Qualifier: "Class IV"